Received any experimental drugs or devices within 30 days or 5 half lives, whichever is longer, prior to dosing.

The above is a clinical trial exclusion criterion. Annotated with entity spans:
Received any [Context_Error: experimental drugs or devices within 30 days or 5 half lives], whichever is longer, prior to dosing.